Inability to perform exercise tests

The above is a clinical trial exclusion criterion. Annotated with entity spans:
[Condition: Inability to perform] [Procedure: exercise tests]